Clinical trial exclusion criterion:
Contraindication to neuraxial (coagulopathy, anticoagulant use, local infection, sepsis etc) .Rupture of membranes.

Entity relations:
- AND("Contraindication", "neuraxial")
- AND("Contraindication", "anticoagulant")
- OR("coagulopathy", "sepsis", "anticoagulant", "local infection")
- OR("Contraindication", "Rupture of membranes")